Clinical trial exclusion criterion:
any skin breakdown (pressure sores)

Entity relations:
- Subsumes("skin breakdown", "pressure sores")